How many groups of viruses exist  in the Baltimore Classification?

seven "Baltimore classes" (BCs) that define the major features of virus reproduction